Clinical trial inclusion criterion:
3. Documented radiographic disease progression < 12 months after the last dose of first- or second-line platinum-based chemotherapy.

Entity relations:
- AND("radiographic", "disease progression")
- Has_index("< 12 months after the last dose of first- or second-line platinum-based chemotherapy", "the last dose of first- or second-line platinum-based chemotherapy")
- Has_temporal("disease progression", "< 12 months after the last dose of first- or second-line platinum-based chemotherapy")